有位感染 Mycobacterium leprae（M. leprae）的病人前來就診，病人主要有皮膚發炎與神經系統發炎的症狀，血液中對抗 M. leprae 的抗體效價不高，巨噬細胞內的 M. leprae 也沒有很多，下列那種細胞比較可能與病人臨床症狀有關？
A. 第一型輔助型T細胞（TH1）
B. 第二型輔助型T細胞（TH2）
C. 第三型輔助型T細胞（TH3）
D. 調節性T細胞（regulatory T cell）

正確答案：A. 第一型輔助型T細胞（TH1）